Clinical trial exclusion criterion:
Inmate of a correctional facility (i.e. prisoners).

Entity relations:
- Subsumes("Inmate of a correctional facility", "prisoners")